Acute heart failure or during episodes of heart failure decompensation requiring intravenous inotropic therapy.

The above is a clinical trial exclusion criterion. Annotated with entity spans:
[Condition: Acute heart failure] or during episodes of [Condition: heart failure decompensation] requiring [Procedure: intravenous inotropic therapy].